Clinical trial inclusion criterion:
Feasibility of patch testing.

Annotated entities:
- Mood: "Feasibility of"
- Post-eligibility: "patch testing"